Clinical trial inclusion criterion:
Availability of patient's medical records data about the previous treatment with ADASUVE® at hospital setting.

Annotated entities:
- Non-query-able: "Availability of patient's medical records data about the previous treatment with ADASUVE® at hospital setting"